Clinical trial exclusion criterion:
preterm delivery (<37 weeks of gestation)

Annotated entities:
- Condition: "preterm delivery"
- Value: "<37 weeks"
- Measurement: "gestation"